Clinical trial exclusion criterion:
Subject has any contraindication for oral anticoagulation.

Annotated entities:
- Condition: "contraindication"
- Drug: "oral anticoagulation"